下列有關胃腺壁細胞（parietal cells）的敘述，何者錯誤？
A. 具有胞內小管系統（intracellular canaliculi）和微絨毛（microvilli）
B. 不存在於賁門（cardiac region）
C. 可在胞質內合成鹽酸（HCl）
D. 可分泌鹽酸（HCl）和內在因子（intrinsic factor），幫助維生素B12吸收

正確答案：C. 可在胞質內合成鹽酸（HCl）